Children 2-5 years with negative TSTs who have been in close contact with a case of active TB disease recently

The above is a clinical trial inclusion criterion. Annotated with entity spans:
[Person: Children] [Value: 2-5] [Person: years] with [Value: negative] [Measurement: TSTs] [Non-query-able: who have been in close contact with a case of active TB disease recently]